Un hombre de 65 años tiene un cáncer terminal avanzado. ¿Qué dato indicaría que está cerca del final de su vida? Señale la mejor opción:
1. Distensión abdominal.
2. Temperatura de 38º C.
3. Incontinencia urinaria.
4. Respiración estertorosa.
5. Somnolencia.

Respuesta correcta: 4. Respiración estertorosa.